Clinical trial inclusion criterion:
willingness to receive rescue therapy

Entity relations:
- Has_mood("rescue therapy", "willingness")